Clinical trial inclusion criterion:
Severe heart, lung and central nervous system disorders.

Entity relations:
- Has_qualifier("heart disorders", "Severe")
- OR("heart disorders", "lung disorders", "entral nervous system disorders")